Clinical trial exclusion criterion:
Infants who have already received postnatal vitamin D supplementation

Entity relations:
- multi("postnatal vitamin D supplementation", "vitamin D")